下列那一項並非造成 Colon diverticular disease 增多的原因？
A. Aging
B. High sugar diet
C. High meat diet
D. High fiber diet

正確答案：D. High fiber diet